Clinical trial inclusion criteria:
Women with POI: For the purpose of the research women is considered to have POI if she is aged less than 40 years and has amenorrhea of at least 4 month with FSH level above 25 IU/L (repeated twice >4 weeks apart).

Annotated entities:
- Person: "Women"
- Condition: "POI"
- Person: "aged"
- Value: "less than 40 years"
- Condition: "amenorrhea"
- Temporal: "at least 4 month"
- Measurement: "FSH level"
- Value: "above 25 IU/L"
- Multiplier: "repeated twice"
- Temporal: ">4 weeks apart"